Four weeks or less since completion of treatment using an investigational product/device in another clinical study or presence of any unresolved toxicity from previous treatment

The above is a clinical trial exclusion criterion. Annotated with entity spans:
[Temporal: Four weeks or less since completion of treatment] using an [Drug: investigational product]/device in [Competing_trial: another clinical study] or presence of any [Qualifier: unresolved] [Condition: toxicity] from [Temporal: previous] [Procedure: treatment]